Clinical trial inclusion criterion:
6. Has a 6-minute walk distance that is ≥150 and ≤500 meters.

Entity relations:
- Has_value("6-minute walk distance", "≥150 and ≤500 meters")